Venous incompetence confirmed by clinical assessment and duplex ultrasound scan

The above is a clinical trial inclusion criterion. Annotated with entity spans:
[Condition: Venous incompetence] confirmed by [Procedure: clinical assessment] and [Procedure: duplex ultrasound scan]